Participant aged 19 or over

The above is a clinical trial inclusion criterion. Annotated with entity spans:
Participant [Person: aged] [Value: 19 or over]